下列那一病毒感染，不經由抑制寄主腫瘤抑制基因之功能形成腫瘤？
A. 腺病毒（Adenovirus）
B. 人類嗜 T 淋巴球病毒（HTLV-1）
C. 人類乳突病毒（HPV）
D. 多瘤病毒（SV40）

正確答案：B. 人類嗜 T 淋巴球病毒（HTLV-1）